Clinical trial exclusion criterion:
The participant has received neurosurgical intervention for Parkinson's disease (e.g., pallidotomy, thalamotomy, deep brain stimulation).

Annotated entities:
- Procedure: "neurosurgical intervention"
- Condition: "Parkinson's disease"
- Condition: "pallidotomy"
- Condition: "thalamotomy"
- Condition: "deep brain stimulation"